Known neurological disorders or documented serious head injury.

The above is a clinical trial exclusion criterion. Annotated with entity spans:
Known [Condition: neurological disorders] or documented [Qualifier: serious] [Condition: head injury].